下列有關喉頭痙攣（laryngospasm）的敘述，何者錯誤？
A. 好發在麻醉誘導及拔管時
B. 在麻醉狀態 stageⅠ時容易發生
C. 可先以正壓輔助呼吸處置
D. 可以 succinylcholine 解除喉頭痙攣情形

正確答案：B. 在麻醉狀態 stageⅠ時容易發生